Clinical trial inclusion criterion:
Withdrawn from statins because of perceived side effects

Annotated entities:
- Non-query-able: "Withdrawn from statins because of perceived side effects"